has current oral lesions, canker sores, or piercings

The above is a clinical trial exclusion criterion. Annotated with entity spans:
has [Temporal: current] [Condition: oral lesions], [Condition: canker sores], or [Device: piercings]